Fetal destress or gestational age < 36 week

The above is a clinical trial exclusion criterion. Annotated with entity spans:
[Condition: Fetal destress] or [Measurement: gestational age] [Value: < 36 week]